Albumin = 2.5 g/dL

The above is a clinical trial inclusion criterion. Annotated with entity spans:
[Measurement: Albumin] [Value: = 2.5 g/dL]